Clinical trial inclusion criterion:
Gestational age = 37 weeks,

Entity relations:
- Has_value("Gestational age", "= 37 weeks")